Antiretroviral naive

The above is a clinical trial inclusion criterion. Annotated with entity spans:
[Drug: Antiretroviral] [Condition: naive]